Clinical trial inclusion criterion:
acute myocardial infarction or

Annotated entities:
- Condition: "acute myocardial infarction"